Clinical trial exclusion criterion:
Is currently participating or has participated in a study with an investigational agent or using an investigational device within 4 weeks of the first dose of study medication

Annotated entities:
- Non-query-able: "Is currently participating or has participated in a study with an investigational agent or using an investigational device within 4 weeks of the first dose of study medication"